Use of oral contraceptive pills, patches, implants or hormonal intrauterine contraception in the month prior to screening

The above is a clinical trial exclusion criterion. Annotated with entity spans:
Use of [Drug: oral contraceptive pills], [Device: patches], [Device: implants] or [Procedure: hormonal intrauterine contraception] [Temporal: in the month prior to screening]